下列何者不是骨盆壁筋膜（parietal pelvic fascia）的構造？
A. 子宮圓韌帶（round ligament of uterus）
B. 主韌帶（cardinal ligament）
C. 子宮薦骨韌帶（utero-sacral ligament）
D. 恥骨子宮頸韌帶（pubo-cervical ligament）

正確答案：A. 子宮圓韌帶（round ligament of uterus）